下列何者不是登革出血熱的臨床表現？
A. 發燒
B. 點狀出血、紫斑
C. 血小板下降（thrombocytopenia）
D. 血比容下降20%以上

正確答案：D. 血比容下降20%以上